Clinical trial exclusion criteria:
on hemodialysis for less than 3 months
comorbid psychotic, bipolar, substance use dependence, Alzheimer's or dementia

Annotated entities:
- Procedure: "hemodialysis"
- Temporal: "for less than 3 months"
- Condition: "psychotic"
- Condition: "bipolar"
- Condition: "substance use dependence"
- Condition: "Alzheimer's"
- Condition: "dementia"
- Temporal: "comorbid"